40歲的女性病患主訴反覆眩暈發作數年，病史中得知每次發作都有懼光（photophobia）或懼音（phonophobia），且常常發作都與月經期有關。當食用乳製品（dairy products如起司等）過量時也會眩暈發作，由此病史，她最有可能的診斷為何？
A. 前庭性偏頭痛（vestibular migraine）
B. 前庭神經炎（vestibular neuritis）
C. 美尼爾氏症（Ménière's disease）
D. 良性陣發性姿勢型眩暈（BPPV）

正確答案：A. 前庭性偏頭痛（vestibular migraine）